Clinical trial inclusion criterion:
Able to provide verbal consent

Annotated entities:
- Informed_consent: "Able to provide verbal consent"